What is the purpose of the Unique Connectivity of Uncharged Compounds (UC2) search tool?

The Unique Connectivity of Uncharged Compounds (UC2) search tool uses unique connectivity of uncharged compounds for metabolite annotation by database searching in mass spectrometry-based metabolomics.